一位 18 歲女性，主訴從來不曾有月經，乳房發育不全，無陰毛，下列檢查何者不需要做？
A. 細胞染色體核型（Karyotype）
B. 濾泡刺激素（Follicle-stimulating hormone）
C. 絨毛膜促性腺激素（Human chorionic gonadotropin）
D. 超音波檢查

正確答案：C. 絨毛膜促性腺激素（Human chorionic gonadotropin）